Ability to understand and the willingness to sign a written informed consent.

The above is a clinical trial inclusion criterion. Annotated with entity spans:
[Observation: Ability to understand] and the [Observation: willingness to sign a written informed consent].